¿Cuál de los siguientes tratamientos psicológicos para la depresión NO se puede clasificar como un tratamiento bien establecido?:
1. Terapia de activación.
2. Terapia cognitiva.
3. Terapia sistémica.
4. Terapia interpersonal.

Respuesta correcta: 3. Terapia sistémica.